Clinical trial exclusion criterion:
pre-operative opioid analgesics

Entity relations:
- Has_temporal("opioid analgesics", "pre-operative")